Clinical trial exclusion criterion:
Multiple significant trauma (i.e. significant intracranial and extracranial injuries including limb fractures) that would limit observation of recovery from spinal cord injury

Entity relations:
- Has_qualifier("trauma", "Multiple")
- Has_qualifier("trauma", "significant")
- Subsumes("trauma", "extracranial injuries")
- Subsumes("trauma", "intracranial injuries")
- Subsumes("trauma", "limb fractures")